What are some of the effects of Zika Virus in infected individuals?

While most of the symptoms of zika virus are relatively mild, zika virus in pregnant mothers can cause microcephaly and other congenital defects in the fetus.